Cerebrospinal Fluid (CSF) leak

The above is a clinical trial exclusion criterion. Annotated with entity spans:
[Condition: Cerebrospinal Fluid (CSF) leak]